一位 7 歲大女童因急性淋巴性白血病復發，接受臍帶血造血幹細胞移植，第 45 天後出現幾天的全身紅疹及有脫屑（desquamation）現象，並有水樣腹瀉（watery diarrhea）情形，周邊血液無異 常白血球出現，aspartate aminotransferase（AST; SGOT）：85 U/L，alanine aminotransferase（ALT; SGPT）：128 U/L，total bilirubin：2.5 mg/dL，CRP 正常，臨床上病人無發燒，無咳嗽，活動力並無明顯異常，下列何種疾病最有可能？
A. acute graft-versus-host disease（GVHD）
B. chronic graft-versus-host disease（GVHD）
C. Candida infection
D. Epstein-Barr virus（EBV）infection

正確答案：A. acute graft-versus-host disease（GVHD）